Which diagnostic test is approved for coronavirus infection screening?

Real-time reverse transcription-PCR (rRT-PCR) is mostly used as the lab test for screening coronaviral infection.